一位 6 個月大的男孩由父母帶至門診求診，主訴自出生後即有異位性皮膚炎，易流鼻血，實驗室檢查發現血小板數目偏低，下列何者錯誤？
A. 周邊血液抹片可見血小板變大
B. 為性聯隱性遺傳（X-linked recessive）
C. 病童常有皮膚、中耳或肺部之反覆感染
D. 病人之體液型免疫反應（humoral immune response）有缺陷，常見IgM低下及IgA、IgE上升

正確答案：A. 周邊血液抹片可見血小板變大